下列何者不是 high-renin 高血壓的特點？
A. 鹽分進食不影響血管收縮反應
B. 對利尿劑有療效
C. 對乙型交感神經抑制劑有療效
D. 對 angiotensin II antagonist 有療效

正確答案：B. 對利尿劑有療效